ECOG performance status =2.

The above is a clinical trial inclusion criterion. Annotated with entity spans:
[Measurement: ECOG performance status] [Value: =2].